Clinical trial exclusion criterion:
Patients with an active or suspected latent infection in or about the knee joint

Annotated entities:
- Condition: "infection"
- Qualifier: "knee joint"